Clinical trial inclusion criterion:
Hepatitis C recurrence defined by the presence of abnormal liver function test, positive HCV-RNA, histological signs of hepatitis C recurrence.

Annotated entities:
- Condition: "Hepatitis C"
- Multiplier: "recurrence"
- Measurement: "liver function test"
- Value: "abnormal"
- Measurement: "HCV-RNA"
- Value: "positive"
- Procedure: "histological"
- Condition: "hepatitis C"
- Multiplier: "recurrence"
- Condition: "histological signs of hepatitis C recurrence"